Una prueba coagulasa positiva es típica de:
1. Staphylococcus aureus.
2. Staphylococcus epidermidis.
3. Haemophilus influenzae.
4. Neisseria meningitidis.
5. Escherichia coli.

Respuesta correcta: 1. Staphylococcus aureus.